Any other factor that, in the opinion of the investigator, would prevent the patient from complying with the requirements of the protocol.

The above is a clinical trial exclusion criterion. Annotated with entity spans:
[Post-eligibility: Any other factor that, in the opinion of the investigator, would prevent the patient from complying with the requirements of the protocol.]